Clinical trial inclusion criterion:
A priori access must be right or left radial artery.

Annotated entities:
- Procedure: "access"
- Qualifier: "priori"
- Qualifier: "left radial artery"
- Qualifier: "right radial artery"